Acude a la consulta Mar con su hijo de 18 meses y su madre Carmen, viuda de 67 años que actualmente cuida de su nieto. Durante la entrevista Mar refiere “mi madre está siempre intentando que mi hijo coma un huevo al día porque dice que es necesario para que crezca fuerte”. Esta afirmación confirmada por Carmen refleja en la abuela el concepto de:
1. Acción de autocuidado.
2. Creencia sobre la salud.
3. Conducta positiva de salud.
4. Protección ineficaz.

Respuesta correcta: 2. Creencia sobre la salud.